Contraindication for thoracic paravertebral block

The above is a clinical trial exclusion criterion. Annotated with entity spans:
[Condition: Contraindication] for [Qualifier: thoracic] [Procedure: paravertebral block]